Suponga que a un tratamiento A responden un 40% de los pacientes. El coste medio con A para los pacientes que responden es de 2.000€ por paciente. El coste medio con A para los pacientes que no responden es de 5.000€. ¿Cuál es el coste esperado del tratamiento A para un paciente?:
1. 2.000€.
2. 3200€.
3. 3500€.
4. 3.800€.
5. 5.000€.

Respuesta correcta: 4. 3.800€.